Clinical trial exclusion criterion:
Untreated thyrotoxicosis.

Entity relations:
- Has_qualifier("thyrotoxicosis", "Untreated")